Clinical trial exclusion criterion:
refractory bradycardia < 60 bpm despite treatment

Entity relations:
- Has_value("bradycardia", "< 60 bpm")
- Has_qualifier("bradycardia", "refractory")
- multi("despite treatment", "treatment")
- Has_qualifier("bradycardia", "despite treatment")